Clinical trial exclusion criterion:
Renal failure, moderate or severe renal impairment (estimated glomerular filtration rate < 30 mL/min/1.73 m2), or ongoing dialysis

Entity relations:
- Has_qualifier("renal impairment", "moderate")
- Has_value("estimated glomerular filtration rate", "< 30 mL/min/1.73 m2")
- Has_temporal("dialysis", "ongoing")
- Subsumes("renal impairment", "estimated glomerular filtration rate")
- OR("moderate", "severe")
- OR("Renal failure", "renal impairment", "dialysis")